anaemia (Hb <105 g/L [10.5 g/dL]) at inclusion, lack of informed consent

The above is a clinical trial exclusion criterion. Annotated with entity spans:
[Condition: anaemia] ([Measurement: Hb] [Value: <105 g/L] [[Value: 10.5 g/dL]]) [Temporal: at inclusion], [Informed_consent: lack of informed consent]